Can't express his complain correctly and can't cooperate with the researcher

The above is a clinical trial exclusion criterion. Annotated with entity spans:
[Non-query-able: Can't express his complain correctly and can't cooperate with the researcher]